Evidence of puberty: physical signs and serum luteinizing hormone > 0.3 IU/L and testosterone > 15 ng/dl

The above is a clinical trial inclusion criterion. Annotated with entity spans:
[Observation: Evidence of puberty]: [Condition: physical signs] and [Measurement: serum luteinizing hormone] [Value: > 0.3 IU/L] and [Measurement: testosterone] [Value: > 15 ng/dl]